Clinical trial inclusion criterion:
18-35 years old

Entity relations:
- Has_value("old", "18-35 years")